Clinical trial inclusion criterion:
Confirmed idiopathic pulmonary hypertension, connective tissue disease associated pulmonary hypertension, congenital heart disease(with Eisenmenger syndrome) associated pulmonary hypertension.

Annotated entities:
- Condition: "idiopathic pulmonary hypertension"
- Qualifier: "connective tissue disease associated"
- Condition: "pulmonary hypertension"
- Qualifier: "congenital heart disease"
- Condition: "Eisenmenger syndrome"
- Condition: "pulmonary hypertension"